Clinical trial inclusion criterion:
Patients must have histologic proof of a malignancy suitable for radiation therapy.

Annotated entities:
- Condition: "malignancy"
- Qualifier: "suitable for radiation therapy"
- Procedure: "radiation therapy"
- Procedure: "histologic"
- Value: "proof"
- Subjective_judgement: "suitable for radiation therapy"